Clinical trial inclusion criterion:
Male, or female, 19 years to 75 years.

Annotated entities:
- Person: "Male"
- Person: "female"
- Person: "years"
- Value: "19 years to 75"